Clinical trial exclusion criterion:
History of clinically-significant drug allergy to nucleoside/nucleotide analogs.

Entity relations:
- Has_qualifier("drug allergy", "clinically-significant")
- AND("drug allergy", "nucleoside")
- OR("nucleoside", "nucleotide analogs")